52歲男性病人在手術後抽血檢查發現血清鈉離子（serum sodium ion）的濃度為117 mEq/L。下列敘述何者正確？
A. 此病人除了疼痛之外，沒有其他症狀
B. 此病人的低鈉血症（hyponatremia）歸類為中度低鈉血症（moderate hyponatremia）
C. 無症狀病人以含鈉輸液治療時，其輸液注射的速率應使增加的血清鈉離子濃度不超過0.5 mEq/L/hr，一天不超過8～12 mEq/L
D. 可以觀察其病情，不必採取其他的治療

正確答案：C. 無症狀病人以含鈉輸液治療時，其輸液注射的速率應使增加的血清鈉離子濃度不超過0.5 mEq/L/hr，一天不超過8～12 mEq/L